Clinical trial inclusion criterion:
Normal cognitive status according to MiniCog

Entity relations:
- AND("MiniCog", "Normal cognitive status")